一位 55 歲婦女，因子宮脫垂做子宮全切除及雙側卵巢全切除後，擔心術後身體不適，這種情況生理變化會是那一項？
A. Insulin resistance decrease
B. Serum estrone level increase
C. Serum testosterone level decrease
D. Total cholesterol decrease

正確答案：C. Serum testosterone level decrease